Clinical trial exclusion criterion:
immunodepressed patients (bone marrow transplant patients, patients with severe neutropenia),

Annotated entities:
- Condition: "immunodepressed"
- Procedure: "bone marrow transplant"
- Condition: "severe neutropenia"